Clinical trial inclusion criteria:
Age =18 years
Objectively confirmed diagnosis of acute PE by multidetector CT angiography, ventilation/perfusion lung scan, or selective invasive pulmonary angiography, according to established diagnostic criteria, with or without symptomatic deep vein thrombosis
Absence of hemodynamic collapse, or decompensation, at presentation; Hemodynamic collapse or decompensation
At least one sign of RV pressure overload/dysfunction on CT angiography or echocardiography
Signs of myocardial injury as indicated by elevated troponin levels
Signs of (RV) failure as indicated by NT-proBNP levels >600 pg/ml at baseline.
Ability of the subject to understand the character and individual consequences of the clinical trial; signed and dated informed consent of the subject available before the start of any specific trial procedures

Annotated entities:
- Person: "Age"
- Value: "=18 years"
- Qualifier: "acute"
- Condition: "PE"
- Procedure: "CT angiography"
- Procedure: "ventilation/perfusion lung scan"
- Procedure: "invasive pulmonary angiography,"
- Condition: "deep vein thrombosis"
- Condition: "hemodynamic collapse"
- Negation: "Absence"
- Condition: "hemodynamic decompensation"
- Multiplier: "At least one"
- Condition: "sign of RV pressure overload"
- Condition: "sign of RV pressure dysfunction"
- Procedure: "CT angiography"
- Procedure: "echocardiography"
- Measurement: "troponin levels"
- Value: "elevated"
- Condition: "myocardial injury"
- Condition: "RV) failure"
- Measurement: "NT-proBNP levels"
- Value: ">600 pg/ml"
- Post-eligibility: "Ability of the subject to understand the character and individual consequences of the clinical trial; signed and dated informed consent of the subject available before the start of any specific trial procedures"